Clinical trial inclusion criterion:
Functional Class II and III by the New York Heart Association (NYHA)

Entity relations:
- Has_value("New York Heart Association (NYHA)", "Class II and III")